下列何者非carbamazepine的臨床適應症？
A. 癲癇（epilepsy）
B. 三叉神經痛（trigeminal neuralgia）
C. 憂鬱症（depression）
D. 躁狂症（mania）

正確答案：C. 憂鬱症（depression）